Clinical trial exclusion criterion:
Has received locoregional therapy to liver (transcatheter chemoembolization [TACE], transcatheter embolization [TAE], hepatic arterial infusion [HAI], radiation, radioembolization, or ablation) or other site within 4 weeks prior to the first dose of study medication

Annotated entities:
- Procedure: "locoregional therapy"
- Procedure: "transcatheter chemoembolization [TACE]"
- Procedure: "transcatheter embolization [TAE]"
- Procedure: "hepatic arterial infusion [HAI]"
- Procedure: "radiation"
- Procedure: "radioembolization"
- Procedure: "ablation"
- Temporal: "within 4 weeks prior"
- Reference_point: "first dose of study medication"
- Qualifier: "liver"
- Qualifier: "other site"